Known contact with an INH or rifampin resistant case

The above is a clinical trial exclusion criterion. Annotated with entity spans:
Known contact with an [Drug: INH] or [Drug: rifampin] [Condition: resistant] case